Clinical trial exclusion criterion:
Current or recent treatment with pegylated interferon (PEG-IFN).

Annotated entities:
- Drug: "pegylated interferon"
- Drug: "PEG-IFN"
- Procedure: "treatment"
- Temporal: "recent"
- Temporal: "Current"